A known allergy to Celecoxib, aspirin or another NSAID.

The above is a clinical trial exclusion criterion. Annotated with entity spans:
A known [Condition: allergy] to [Drug: Celecoxib], [Drug: aspirin] or [Qualifier: another] [Drug: NSAID].